Clinical trial exclusion criterion:
are not willing to use a reliable method of barrier contraception during the study, or

Annotated entities:
- Pregnancy_considerations: "are not willing to use a reliable method of barrier contraception during the study"